一位 70 歲婦人因膽囊炎併發腹膜炎住院。住院時腎功能為 BUN 28 mg/dL，Creatinine 1.2 mg/dL。給予抗生素 cefazolin 1 g q8h 和 gentamicin 80 mg q12h 注射，並予全靜脈營養法。三天後體溫下降至 37℃，脈搏、血壓正常，此時體重為 45 公斤。一週後開始給予軟性食物。第十天測得 BUN 和 Creatinine 各為 40 和 3.5 mg/dL，血清電解質（mmol/L）：Na 134, K 3.3, Cl 95；病人一日尿量測得為 2000 mL，尿液分析正常。有關此病人腎臟問題的敘述，下列何者最為正確？
A. 尿液檢查通常會出現嚴重的蛋白尿，並且出現微觀血尿
B. 會出現尿液鎂離子流失
C. 主要是遠端腎小管發生壞死
D. 是腎輸出小動脈擴張所致

正確答案：B. 會出現尿液鎂離子流失